下列那一項不是篩檢乾眼症的方法？
A. Schirmer test
B. 角膜、結膜螢光染色（fluorescein stain）
C. 鏡射光顯微鏡（specular microscope）
D. 淚液層裂解時間（tear film break-up time）

正確答案：C. 鏡射光顯微鏡（specular microscope）